關於 Sugiura procedure 之敘述，下列何者錯誤？
A. 屬於一種 selective shunt
B. 適合於 splenic vein thrombosis
C. 須作 esophageal transection
D. 於 alcoholic liver cirrhosis 的病人有較高的 rebleeding rate

正確答案：A. 屬於一種 selective shunt